Enrollment in another trial

The above is a clinical trial exclusion criterion. Annotated with entity spans:
[Competing_trial: Enrollment in another trial]